Clinical trial inclusion criterion:
aged 20 years or greater

Annotated entities:
- Person: "aged"
- Value: "20 years or greater"